Subjects must be able and willing to give written informed consent and to comply with the requirements of this study protocol

The above is a clinical trial inclusion criterion. Annotated with entity spans:
[Non-query-able: Subjects must be able and willing to give written informed consent and to comply with the requirements of this study protocol]